Clinical trial exclusion criterion:
Other clinically significant medical conditions that could interfere with the trial

Annotated entities:
- Non-query-able: "Other clinically significant medical conditions that could interfere with the trial"